Clinical trial inclusion criterion:
(1)Completed MTHFR C677T gene polymorphism detection in run-in period or MTHFR C677T genotype already known in advance;

Entity relations:
- Has_qualifier("genotype already known", "MTHFR C677T")
- Has_qualifier("gene polymorphism detection", "MTHFR C677T")
- OR("gene polymorphism detection", "genotype already known")